Clinical trial exclusion criterion:
History of epilepsy or convulsions due to any reason.

Entity relations:
- OR("epilepsy", "convulsions")